Clinical trial inclusion criterion:
Patients who have non muscle invasive bladder cancer male patients patients between 40-80 years old

Entity relations:
- Has_value("old", "between 40-80 years")